關於減重手術（bariatric surgery），下列敘述何者錯誤？
A. 對新陳代謝的好處，部分是因為改變了腸道荷爾蒙分泌濃度所致
B. 通常在限制型（restrictive）手術之外，再合併吸收不良型（malabsorptive）手術，可增加減重效果
C. 可用來改善重度肥胖之第二型糖尿病病人的血糖控制
D. 無法降低重度肥胖病人的死亡率

正確答案：D. 無法降低重度肥胖病人的死亡率